Able and willing to comply with all pre- and follow-up testing and requirements

The above is a clinical trial inclusion criterion. Annotated with entity spans:
A[Post-eligibility: ble and willing to comply with all pre- and follow-up testing and requirements]